Clinical trial inclusion criterion:
1. Signed informed consent

Annotated entities:
- Parsing_Error: "1."
- Post-eligibility: "Signed informed consent"
- Non-query-able: "Signed informed consent"